Use of loop diuretics.

The above is a clinical trial exclusion criterion. Annotated with entity spans:
Use of [Drug: loop diuretics].